• All patients attending for a routine diagnostic endoscopic procedure at St Mary's Hospital NHS Trust for dyspepsia and abdominal pain

The above is a clinical trial inclusion criterion. Annotated with entity spans:
• All patients attending for a routine [Procedure: diagnostic endoscopic procedure] at [Visit: St Mary's Hospital NHS Trust] for [Condition: dyspepsia] and [Condition: abdominal pain]